Clinical trial exclusion criterion:
Patients unable to understand the objectives of the dietary intervention

Annotated entities:
- Non-query-able: "Patients unable to understand the objectives of the dietary intervention"